Clinical trial inclusion criterion:
 First group: allergic patients

Annotated entities:
- Condition: "allergic"